Hombre de 60 años de edad con antecedentes de hipertensión arterial y dislipemia ha sido recientemente diagnosticado de insuficiencia cardiaca. Tras realizar las pruebas pertinentes se objetiva que conserva la fracción de eyección del ventrículo izquierdo (>50%). En relación al tratamiento señale la respuesta INCORRECTA:
1. El tratamiento inicial debería dirigirse al proceso patológico subyacente.
2. El tratamiento con diuréticos debe iniciarse a dosis altas.
3. En caso de precisar tratamiento con nitratos debe iniciarse a dosis bajas.
4. La disnea puede tratarse reduciendo la activación neurohormonal con inhibidores de la enzima convertidora de la angiotensina o antagonistas de los receptores de la angiotensina.

Respuesta correcta: 2. El tratamiento con diuréticos debe iniciarse a dosis altas.